Which are the known inhibitors of the TPL2/MAP3K8 protein?

Honokiol
Thieno[3,2-d]pyrimidines and thieno[2,3-c]pyridine
Quinoline-3-carbonitrile derivatives (8-halo-4-(3-chloro-4-fluoro-phenylamino)-6-[(1H-[1,2,3]triazol-4-ylmethyl)-amino]-quinoline-3-carbonitriles; 8-bromo-4-(3-chloro-4-fluorophenylamino)-6-[(1-methyl-1H-imidazol-4-yl)methylamino]quinoline-3-carbonitrile; 4-alkylamino-[1,7]naphthyridine-3-carbonitrile; 1,7-naphthyridine-3-carbonitriles)
Indazoles
Luteolin
1,7-naphtyridine-3-carbonitrile